gestational age between 20 weeks and 23 weeks and 6 days

The above is a clinical trial inclusion criterion. Annotated with entity spans:
[Measurement: gestational age] [Value: between 20 weeks and 23 weeks and 6 days]